Pregnant females, and

The above is a clinical trial exclusion criterion. Annotated with entity spans:
[Condition: Pregnant] [Person: females], and